Elevated triglycerides (=150 mg/dl), or on medication for treating the condition

The above is a clinical trial inclusion criterion. Annotated with entity spans:
[Value: Elevated] [Measurement: triglycerides] ([Value: =150 mg/dl]), or on [Drug: medication for treating] the condition